懷孕 3 個月後，切除卵巢一般不會導致流產，原因為何？
A. 母親體內仍有足夠黃體促素（LH）
B. 母親體內仍有足夠濾泡促素（FSH）
C. 胎盤產生足夠的雌激素（estrogen）及助孕素（progesterone）維持子宮內膜厚度
D. 胎盤產生足夠的雌激素及雄性素（androgen）維持子宮內膜厚度

正確答案：C. 胎盤產生足夠的雌激素（estrogen）及助孕素（progesterone）維持子宮內膜厚度